Unability to give informed consent

The above is a clinical trial exclusion criterion. Annotated with entity spans:
[Negation: Unability to] [Observation: give informed consent]